Patient body height greater or equal to 140 cm

The above is a clinical trial inclusion criterion. Annotated with entity spans:
Patient [Measurement: body height] [Value: greater or equal to 140 cm]